Clinical trial exclusion criterion:
Allergy to povidone iodine.

Entity relations:
- AND("Allergy", "povidone iodine")